¿Cuál de las siguientes causas de disfunción eréctil reacciona con mayor sensibilidad a la inyección intracavernosa de drogas vasoactivas?
1. Venosa.
2. Arterial.
3. Neurógena.
4. Hormonal.

Respuesta correcta: 3. Neurógena.